Clinical trial inclusion criterion:
Age 10 to 65 years

Entity relations:
- Has_value("Age", "10 to 65 years")